Un hombre de 70 años presenta desde hace unos meses, sin traumatismo previo, dolor lumbar, dificultad para la marcha, pérdida de fuerza y parestesias en miembros inferiores, teniendo que pararse a los pocos metros de iniciar la misma. El paciente cada vez más va inclinando el tronco hacia adelante. ¿Cuál es el diagnóstico más probable?
1. Fractura vertebral lumbar osteoporótica.
2. Hernia discal central L5-S1.
3. Espondilodiscitis.
4. Estenosis del canal lumbar.
5. Escoliosis lumbar degenerativa.

Respuesta correcta: 4. Estenosis del canal lumbar.